Clinical trial inclusion criterion:
13. Serum aspartate transaminase (AST) and/or alanine transaminase (ALT) ≤2.5 × ULN

Annotated entities:
- Measurement: "Serum aspartate transaminase (AST)"
- Measurement: "alanine transaminase (ALT)"
- Value: "≤2.5 × ULN"